Clinical trial inclusion criterion:
Condomless sex in the last 3 months with one or more male partners of unknown HIV status known to be at substantial risk of HIV infection (IDU, bisexual, sex for goods, recently incarcerated, from a country with HIV prevalence >1%, interpersonal Partner Violence);

Annotated entities:
- Observation: "Condomless sex"
- Temporal: "in the last 3 months"
- Multiplier: "one or more"
- Person: "male partners"
- Condition: "unknown HIV status"
- Observation: "substantial risk of HIV infection"
- Condition: "HIV infection"
- Observation: "IDU"
- Observation: "bisexual"
- Observation: "sex for goods"
- Observation: "recently incarcerated"
- Observation: "from a country with HIV prevalence >1%"
- Observation: "interpersonal Partner Violence"